Clinical trial inclusion criterion:
Diabetic macular edema involving the center of the macula

Entity relations:
- Has_qualifier("Diabetic macular edema", "center of the macula")